Clinical trial exclusion criterion:
diabetes mellitus.

Annotated entities:
- Condition: "diabetes mellitus"